Clinical trial exclusion criterion:
Pregnancy or breastfeeding

Annotated entities:
- Condition: "Pregnancy"
- Observation: "breastfeeding"